Clinical trial exclusion criterion:
Ongoing hormone replacement therapy;

Annotated entities:
- Temporal: "Ongoing"
- Procedure: "hormone replacement therapy"